21 歲女性病人兩天前開始出現右後側腰痛和排尿不適及疼痛。同時有發燒、畏寒、反胃和嘔吐。尿液分析發現多量細菌及少數上皮細胞。實驗室數據顯示血液中白血球升高。小便也培養出大腸菌（E. coli）。 下列敘述中何者最可能代表她腎臟間質的病理變化？
A. 白血球浸潤並含有多量嗜酸性白血球
B. 慢性肉芽腫發炎
C. 發炎細胞浸潤並含有多量泡沫狀巨噬細胞
D. 中性球浸潤及聚集在腎小管內

正確答案：D. 中性球浸潤及聚集在腎小管內